Participants must have completed 3 cycles of a bortezomib-based induction regimen (as defined by current NCCN guidelines) and have no evidence of disease progression as defined by IMWG criteria.

The above is a clinical trial inclusion criterion. Annotated with entity spans:
Participants must have completed [Multiplier: 3 cycles] of a [Drug: bortezomib]-based [Procedure: induction regimen] (as defined by current [Qualifier: NCCN guidelines]) and have [Value: no evidence of disease progression] as defined by [Measurement: IMWG criteria].